Clinical trial exclusion criterion:
Patients with current scalp infection.

Annotated entities:
- Temporal: "current"
- Condition: "scalp infection"